Clinical trial exclusion criterion:
Screening tool: TMS adult safety questionnaire, Medical History.

Entity relations:
- AND("Screening", "TMS adult safety questionnaire")
- Has_temporal("Screening", "Medical History")